Clinical trial exclusion criteria:
Patients with medical comorbidities preventing them from definitive surgical therapy.
Patients with persistent stone burden following definitive surgical therapy.

Annotated entities:
- Condition: "medical comorbidities"
- Procedure: "definitive surgical therapy"
- Mood: "preventing them from"
- Qualifier: "persistent"
- Observation: "stone burden"
- Temporal: "following definitive surgical therapy"
- Reference_point: "definitive surgical therapy"
- Procedure: "definitive surgical therapy"